天幕脫疝（tentorial herniation）時，何種構造最易掉入天幕切跡（tentorial notch）？
A. 間腦（diencephalon）
B. 顳葉（temporal lobe）
C. 嗅球（olfactory bulb）
D. 腦下垂體（pituitary gland）

正確答案：B. 顳葉（temporal lobe）